10. For females, pregnancy or breast-feeding

The above is a clinical trial exclusion criterion. Annotated with entity spans:
[Parsing_Error: 10.] For [Person: females], [Condition: pregnancy] or [Condition: breast-feeding]